Clinical trial exclusion criterion:
presence of fistula or abscess near the selected tooth

Annotated entities:
- Condition: "fistula"
- Condition: "abscess"
- Qualifier: "near the selected tooth"